39 歲女性因血尿一天至門診就醫。病人有高血壓史三年，每天服用 atenolol 50 mg。病人的父親和姑姑有高血壓和腎臟病，父親於 62 歲因末期腎衰竭接受長期透析治療；病人的兄弟無高血壓或腎臟病。兩天前病人感覺右後腰部有酸痛，但無發燒，當時小便也正常。理學檢查皮膚正常，血壓 138/92 mmHg，無貧血，心臟和胸腔正常，兩側腰部隱約摸到腫大的腎臟，下肢無水腫。神經學檢查正常。尿液分析 檢查：無蛋白尿，每個高倍鏡下紅血球大於 100 個、白血球 3-5 個。下列那個診斷最為可能？
A. 高血壓性腎病變（hypertensive nephropathy）
B. 亞伯特症候群（Alport's syndrome）
C. 特異性高尿鈣症（idiopathic hypercalciuria）
D. 成人型多囊腎病（adult polycystic kidney disease）

正確答案：D. 成人型多囊腎病（adult polycystic kidney disease）